一位 58 歲男性，長期胃痛約 10 年，血清檢查除膽固醇略為增高外，其餘皆在正常範圍內。病人最近因胃出血經急診室住院進行胃部手術。最可能的病理診斷是：
A. 胃腺癌（Adenocarcinoma of stomach）
B. 胃潰瘍（Gastric ulcer）
C. 慢性胃炎（Chronic gastritis）
D. 胃部息肉（Gastric polyp）

正確答案：B. 胃潰瘍（Gastric ulcer）